Available for ongoing follow-up if required

The above is a clinical trial inclusion criterion. Annotated with entity spans:
[Post-eligibility: Available for ongoing follow-up if required]